Clinical trial exclusion criterion:
Researchers consider patients inappropriate to participate in the registry.

Annotated entities:
- Non-query-able: "Researchers consider patients inappropriate to participate in the registry."